Clinical trial inclusion criterion:
Patient diagnosed by HRCT Core Lab with eligible heterogeneous disease distribution and at least one complete oblique fissure.

Entity relations:
- Has_multiplier("complete oblique fissure", "at least one")
- AND("HRCT Core Lab", "heterogeneous disease distribution")
- AND("HRCT Core Lab", "complete oblique fissure")